一位 13 歲的肥胖少年，近二個月來感覺左下肢無力和運動後跛行，今天早上在體育課跳遠後，左腹股溝處發生激烈疼痛，無法站立及行走，他最可能發生何種疾病？
A. femoral neck fracture
B. transient synovitis
C. septic hip
D. slipped capital femoral epiphysis

正確答案：D. slipped capital femoral epiphysis